Según el modelo propuesto por J.P. Guilford, la evaluación de la inteligencia debe realizarse:
1. Midiendo la inteligencia general (o factor g).
2. Estudiando la atención, la memoria y el razonamiento.
3. Siguiendo el enfoque de los estilos cognitivos.
4. Basándose en la medición de los contenidos, operaciones y producciones de las personas evaluadas.

Respuesta correcta: 4. Basándose en la medición de los contenidos, operaciones y producciones de las personas evaluadas.